Clinical trial inclusion criterion:
Renal impairment (AKIN stage = 1) or acute and/or chronic renal replacement therapy

Annotated entities:
- Condition: "Renal impairment"
- Measurement: "AKIN stage"
- Value: "= 1"
- Qualifier: "acute"
- Qualifier: "chronic"
- Procedure: "renal replacement therapy"